Patients with heart transplantation

The above is a clinical trial inclusion criterion. Annotated with entity spans:
Patients with [Procedure: heart transplantation]